La diabetes mellitus tipo MODY (maturityonset diabetes of the young) se caracteriza por todo lo siguiente EXCEPTO:
1. Es un trastorno autosómico dominante.
2. Se caracteriza por un defecto genético de la función de las células beta del páncreas.
3. Comparte el mismo HLA de riesgo que la Diabetes Mellitus tipo 1.
4. Los pacientes presentan una hiperglucemia leve en ayunas.
5. Pueden precisar tratamiento con insulina para su control.

Respuesta correcta: 3. Comparte el mismo HLA de riesgo que la Diabetes Mellitus tipo 1.